Clinical trial exclusion criterion:
Patients who are delirious on initial assessment by ED physician or severe dementia

Annotated entities:
- Condition: "delirious"
- Temporal: "on initial assessment"
- Reference_point: "initial assessment"
- Condition: "dementia"
- Qualifier: "severe"